Collection of written informed consent (legal obligation for any project under the public health law , bioethics laws and / or CNIL) .

The above is a clinical trial inclusion criterion. Annotated with entity spans:
[Non-query-able: Collection of written informed consent (legal obligation for any project under the public health law , bioethics laws and / or CNIL) .]